Histologically proven recurrent or persistent endometrial cancer that is not amenable to curative treatment with surgery and/or radiation therapy AND has failed 2 previous treatment regimens

The above is a clinical trial inclusion criterion. Annotated with entity spans:
[Measurement: Histologically] [Value: proven] [Qualifier: recurrent] or [Qualifier: persistent] [Condition: endometrial cancer] that is [Negation: not] [Qualifier: amenable to curative treatment] with [Procedure: surgery] and/or [Procedure: radiation therapy] AND has [Observation: failed] [Value: 2] [Temporal: previous] [Procedure: treatment regimens]